Clinical trial inclusion criterion:
Albumin = 2.5 g/dL

Entity relations:
- Has_value("Albumin", "= 2.5 g/dL")